Painful active, concurrent cervical spine conditions

The above is a clinical trial exclusion criterion. Annotated with entity spans:
[Condition: Painful] active, concurrent [Condition: cervical spine conditions]